What is crenezumab?

Crenezumab is a humanized antibody targeting Amyloid-β (Aβ) which is currently tested in multiple clinical trials for the prevention of Alzheimer's disease. It strongly reacts with amyloid plaques and detects N-terminally modified Aβ peptides Aβ4-42 and pyroglutamate Aβ3-42.